Clinical trial inclusion criterion:
Post menopausal women with a history of estrogen positive breast cancer who are receiving aromatase inhibitors for at least one month.

Entity relations:
- Has_temporal("aromatase inhibitors", "for at least one month")
- Has_qualifier("breast cancer", "estrogen positive")
- Has_temporal("breast cancer", "history")